有關花斑癬（pityriasis versicolor）之敘述，下列何者錯誤？
A. 最常見於年輕人
B. 致病原為粃糠馬拉色菌綜合菌（Malassezia furfur complex）
C. 致病原未歸類為自然界腐生菌
D. 無法由檢體直接做鏡檢診斷

正確答案：D. 無法由檢體直接做鏡檢診斷